先天性甲狀腺功能低下症的篩檢，對於其檢查工具準確性（accuracy）的考量，下列敘述何者最正確？
A. 敏感度的考量比特異度的考量重要
B. 特異度的考量比敏感度的考量重要
C. 敏感度與特異度的考量一樣重要
D. 視篩檢族群的不同，而有所不同

正確答案：A. 敏感度的考量比特異度的考量重要